Clinical trial inclusion criterion:
followed at the Rothschild Foundation in the Neurology Department

Annotated entities:
- Visit: "Rothschild Foundation in the Neurology Department"